Clinical trial exclusion criterion:
Allergy to hyaluronic acid

Entity relations:
- AND("Allergy", "hyaluronic acid")